下列何種藥物，最適合用於診斷重症肌無力（myasthenia gravis）？
A. echothiophate
B. edrophonium
C. entacapone
D. estazolam

正確答案：B. edrophonium